Clinical trial exclusion criterion:
Subject had any previous left atrial ablation.

Entity relations:
- Has_qualifier("atrial ablation", "left")